Willing and capable to return for all follow-up visits and conduct sleep studies at home, including the evaluation procedures and filling out questionnaires

The above is a clinical trial inclusion criterion. Annotated with entity spans:
[Post-eligibility: Willing and capable to return for all follow-up visits and conduct sleep studies at home, including the evaluation procedures and filling out questionnaires]